Clinical trial inclusion criterion:
5. Can understand the study procedures and can sign an informed consent form.

Annotated entities:
- Non-query-able: "Can understand the study procedures and can sign an informed consent form"